Clinical trial exclusion criterion:
Lifetime history of Bipolar Disorder, Dementia, Autism Spectrum Disorder, Schizophrenia, or any other Psychotic Disorder.

Entity relations:
- OR("Bipolar Disorder", "Dementia", "Autism Spectrum Disorder", "Schizophrenia", "Psychotic Disorder")